Clinical trial inclusion criterion:
HbA1c :>6.5%

Annotated entities:
- Measurement: "HbA1c"
- Value: ">6.5%"